Clinical trial exclusion criterion:
12. Active peptic ulcer or upper gastrointestinal bleeding within the prior 3 months.

Entity relations:
- Has_temporal("peptic ulcer", "Active")
- Has_temporal("peptic ulcer", "within the prior 3 months")
- OR("peptic ulcer", "upper gastrointestinal bleeding")